Clinical trial inclusion criteria:
presence of typical HF symptoms and signs
LV ejection fraction = 50
elevated levels of NT-proBNP (at least >125 pg/ml)
echocardiographic structural (a left atrial volume index > 34 mL/m2 or a left ventricular mass index =115 g/m2 for males and =95 g/m2 for females) or functional alterations (E/e'=13 and a mean e' septal and lateral wall < 9 cm/s).

Annotated entities:
- Condition: "HF symptoms"
- Condition: "HF signs"
- Qualifier: "typical"
- Measurement: "LV ejection fraction"
- Value: "= 50"
- Measurement: "NT-proBNP"
- Qualifier: "elevated"
- Value: "at least >125 pg/ml"
- Measurement: "echocardiographic structural"
- Measurement: "left atrial volume inde"
- Value: "> 34 mL/m2"
- Measurement: "left ventricular mass index"
- Value: "=115 g/m2"
- Person: "males"
- Person: "females"
- Measurement: "left ventricular mass index"
- Value: "=95 g/m2"
- Measurement: "functional alterations"
- Measurement: "E/e'"
- Value: "=13"
- Measurement: "mean e' septal and lateral wall"
- Value: "< 9 cm/s"